Patient has attempted physical therapy and corticosteroid injections with local anesthetic -Previous injections of lidocaine and corticosteroid provided at least minor immediate relief

The above is a clinical trial inclusion criterion. Annotated with entity spans:
Patient has attempted [Procedure: physical therapy] and [Procedure: corticosteroid injections] with l[Drug: ocal anesthetic] [Non-representable: -Previous injections of lidocaine and corticosteroid provided at least minor immediate relief]